History of genetically inherited progressive CNS degenerative disorder (e.g., hereditary paraparesis; MELAS [mitochondrial myopathy, encephalopathy, lactic acidosis, stroke] syndrome)

The above is a clinical trial exclusion criterion. Annotated with entity spans:
History of [Qualifier: genetically inherited] [Condition: progressive CNS degenerative disorder] (e.g., [Condition: hereditary paraparesis]; [Condition: MELAS] [[Condition: mitochondrial myopathy], [Condition: encephalopathy], [Condition: lactic acidosis], [Condition: stroke]] syndrome)